有關學齡前兒童有構音障礙之敘述，下列何者錯誤？
A. 舌繫帶較短的小孩，約有15％會有構音障礙，應及早手術
B. 純音聽力檢查是重要的檢查
C. 言語復健治療，有助於改正構音障礙
D. 黏膜下腭裂是可能的原因之一

正確答案：A. 舌繫帶較短的小孩，約有15％會有構音障礙，應及早手術